Clinical trial exclusion criterion:
Transplanted patients or patients suffering from severe auto-immune disease.

Annotated entities:
- Procedure: "Transplanted"
- Condition: "severe auto-immune disease"